The formation of which inflammatory molecule is regulated by MAP3K8 (TPL2)?

Tpl2 as an important mediator for collaboration of pattern recognition receptors with danger-associated molecular patterns to induce TNF and IL-1beta production and optimal host defense.